Hypersensitivity or contradictions to study drugs

The above is a clinical trial exclusion criterion. Annotated with entity spans:
[Condition: Hypersensitivity] or [Condition: contradictions] to [Drug: study drugs]